有關抗微生物治療原則，下列那一項錯誤？
A. 給予足量及適當療程之有效藥物
B. 某些抗生素每次給予劑量越大，則相隔兩劑量的時間可加長
C. 急性上呼吸道感染（感冒），多為病毒感染，大部分不需使用抗生素
D. 為預防清淨手術術後的感染，應該使用三天預防性抗生素

正確答案：D. 為預防清淨手術術後的感染，應該使用三天預防性抗生素